某一中年男性患者，口唇有多發性褐黑色斑點，且肛門周圍有類似之色素斑，其父親與女兒亦有類似之病灶。以下敘述何者錯誤？
A. 腸胃道內視鏡為必要之檢查
B. 此症患者較常合併腸胃道息肉（polyps）
C. 若有合併腸胃道息肉，80%以上會轉變為惡性
D. 此症唇部之色素病灶不易轉變為惡性腫瘤

正確答案：C. 若有合併腸胃道息肉，80%以上會轉變為惡性